人體中有二大類樹突細胞（dendritic cell），一類為 conventional dendritic cell，另一類為 plasmacytoid dendritic cell。下列有關這二類樹突細胞的敘述，何者錯誤？
A. Plasmacytoid dendritic cell 會表現大量的 TLR-7 與 TLR-9
B. 遇到病毒時，plasmacytoid dendritic cell 會分泌大量的 IFN-α 及 IFN-β
C. Conventional dendritic cell 主要功能為呈現抗原並活化 T 細胞
D. 這二類樹突細胞特徵不同，並不會互相調控對方的功能

正確答案：D. 這二類樹突細胞特徵不同，並不會互相調控對方的功能